Clinical trial exclusion criterion:
Allergic to sirolimus or serious side effects

Annotated entities:
- Condition: "Allergic"
- Drug: "sirolimus"
- Qualifier: "serious"
- Condition: "side effects"